Renal disorder or insufficiency

The above is a clinical trial exclusion criterion. Annotated with entity spans:
[Condition: Renal disorder] or insufficiency